Clinical trial exclusion criterion:
Patients subject to a protection measure.

Annotated entities:
- Condition: "subject to a protection measure"